Clinical trial exclusion criterion:
With other respiratory diseases: such as active pulmonary tuberculosis, non-tuberculosis mycobacteria (NTM) pulmonary disease, pulmonary aspergillosis, etc.

Annotated entities:
- Condition: "respiratory diseases"
- Condition: "pulmonary tuberculosis"
- Qualifier: "active"
- Condition: "non-tuberculosis mycobacteria pulmonary disease"
- Condition: "NTM"
- Condition: "pulmonary aspergillosis"